Clinical trial exclusion criterion:
Participation in another clinical trial within 30 days of enrolment in our trial

Annotated entities:
- Competing_trial: "Participation in another clinical trial within 30 days of enrolment in our trial"